下列何者不是小兒麻痺後症候群（postpolio syndrome）初期最常見的臨床症狀？
A. 肌肉無力
B. 疲勞
C. 關節痠痛
D. 肢體變形

正確答案：D. 肢體變形